Clinical trial exclusion criterion:
Active autoimmune disease requiring immunosuppressive therapy within 30 days

Annotated entities:
- Condition: "autoimmune disease"
- Qualifier: "requiring"
- Procedure: "immunosuppressive therapy"
- Temporal: "within 30 days"
- Temporal: "Active"